Clinical trial exclusion criterion:
Concomitant use with ergot-type oxytocic drugs

Entity relations:
- Has_temporal("ergot-type oxytocic drugs", "Concomitant")